Clinical trial inclusion criterion:
Undergoing elective, primary and unilateral total knee arthroplasty

Annotated entities:
- Procedure: "total knee arthroplasty"
- Qualifier: "unilateral"
- Qualifier: "primary"
- Qualifier: "elective"